Patients with active tumor lysis syndrome (TLS) either from laboratory or clinical changes.

The above is a clinical trial exclusion criterion. Annotated with entity spans:
Patients with active [Condition: tumor lysis syndrome (TLS)] either from laboratory or clinical changes.